Written consent signed

The above is a clinical trial inclusion criterion. Annotated with entity spans:
[Informed_consent: Written consent signed]